好發於中國人之鼻咽癌與下列何種病毒有密切關係？
A. 單純疱疹病毒（Herpes simplex virus）
B. B 型肝炎病毒（Hepatitis B virus）
C. EB 病毒（Epstein-Barr virus）
D. 人類乳頭瘤病毒（Human papillomavirus）

正確答案：C. EB 病毒（Epstein-Barr virus）